Clinical trial exclusion criterion:
HBV infected or HCV infected (these increase the risk of TB-drug induced hepatotoxicity)

Entity relations:
- OR("HBV infected", "HCV infected")